Clinical trial exclusion criterion:
8. Pregnant or nursing females.

Annotated entities:
- Condition: "Pregnant"
- Condition: "nursing"
- Person: "females"